若病患之心輸出量為 4900 mL/min，心跳速率為 70 beats/min，左心室收縮末期體積為 70 mL，則病患之射血比率（ejection fraction）為若干？
A. 0.45
B. 0.50
C. 0.55
D. 0.60

正確答案：B. 0.50